Clinical trial exclusion criterion:
Renal function deficiency (GFR <30 ml/min/1.73m2)

Annotated entities:
- Condition: "Renal function deficiency"
- Measurement: "GFR"
- Value: "<30 ml/min/1.73m2"